Clinical trial inclusion criterion:
LV ejection fraction = 50

Entity relations:
- Has_value("LV ejection fraction", "= 50")